Clinical trial inclusion criteria:
patients undergoing venous malformation embolization operation through general anesthesia.
aged 18-65 years old.
operating time varies 1-4h,and extubation after the operation.

Annotated entities:
- Procedure: "venous malformation embolization operation"
- Procedure: "general anesthesia"
- Person: "aged"
- Value: "18-65 years old"
- Measurement: "operating time"
- Value: "1-4h"
- Procedure: "extubation"
- Temporal: "after the operation"
- Reference_point: "the operation"
- Procedure: "operation"